Clinical trial exclusion criterion:
Morbidly obese with BMI ≥ 40

Entity relations:
- Has_value("BMI", "≥ 40")
- Subsumes("Morbidly obese", "BMI")